Inclusion criteria controls: Matching patients on age (+/- 2 years), sex and parental socioeconomic status, Age 18-45 years, No psychiatric or physical disease.

The above is a clinical trial inclusion criterion. Annotated with entity spans:
Inclusion criteria [Observation: controls]: [Non-representable: Matching patients on age (+/- 2 years), sex and parental socioeconomic status], [Person: Age] [Value: 18-45 years], [Negation: No] [Condition: psychiatric] or [Condition: physical disease].